Clinical trial exclusion criterion:
Patients with intrathecal injectio radiculalgia.

Annotated entities:
- Procedure: "intrathecal injectio radiculalgia"